Clinical trial exclusion criterion:
contra-indications of radiotherapy

Entity relations:
- AND("contra-indications", "radiotherapy")